某研究探討含鉛油漆暴露與兒童智能發展遲緩之相關性，此研究所牽涉的變項包括種族（黑人或白人）、年齡（歲）、以及油漆暴露之程度（按濃度高低分為四級），下列那一個選項的變項依序為 nominal、ordinal、以及 ratio 尺度？
A. 油漆暴露之程度、種族、年齡
B. 年齡、種族、油漆暴露之程度
C. 種族、油漆暴露之程度、年齡
D. 油漆暴露之程度、年齡、種族

正確答案：C. 種族、油漆暴露之程度、年齡